Clinical trial inclusion criterion:
Patients with Fasting Plasma Glucose <15mmol/L(270mg/dL) on screening

Entity relations:
- Subsumes("<15mmol/L", "270mg/dL")
- Has_index("on screening", "screening")
- Has_value("Fasting Plasma Glucose", "<15mmol/L")